Clinical trial inclusion criterion:
Age > 18 years of age

Entity relations:
- Has_value("Age", "> 18 years of age")